Clinical trial exclusion criterion:
those presenting with swallowing problem

Annotated entities:
- Condition: "swallowing problem"